癌細胞對 vincristine 與 methotrexate 產生抗藥性的原因是增加：
A. 黏著分子的表現
B. DNA repair 酵素的表現
C. P-glycoprotein transporter 的表現
D. Glucose-6-phosphate dehydrogenase 的表現

正確答案：C. P-glycoprotein transporter 的表現